Clinical trial exclusion criterion:
patient with a history of hypersensitivity to colistin

Annotated entities:
- Temporal: "history of"
- Condition: "hypersensitivity"
- Drug: "colistin"